Clinical trial exclusion criterion:
Severe bronchial asthma or severe chronic obstructive pulmonary disease.

Annotated entities:
- Condition: "bronchial asthma"
- Qualifier: "Severe"
- Condition: "chronic obstructive pulmonary disease"
- Qualifier: "severe"